Uncontrolled hypertension (defined as average SBP = 160 mmHg [2 readings taken at time of screening]).

The above is a clinical trial exclusion criterion. Annotated with entity spans:
[Qualifier: Uncontrolled] [Condition: hypertension] (defined as [Measurement: average SBP] [Value: = 160 mmHg] [[Multiplier: 2 readings] taken [Temporal: at time of screening]]).